Clinical trial exclusion criterion:
Coadministration of more than 20 mg atorvastatin; 10 mg rosuvastatin; 20 mg of fluvastatin, lovastatin or simvastatin

Entity relations:
- Has_multiplier("atorvastatin", "more than 20 mg")
- Has_multiplier("fluvastatin", "more than 20 mg")
- Has_multiplier("rosuvastatin", "more than 10 mg")
- OR("fluvastatin", "lovastatin", "simvastatin")
- OR("atorvastatin", "rosuvastatin", "fluvastatin")